Clinical trial inclusion criterion:
5. Near distance from the hospital (the patient can reach hospital within one hour )

Annotated entities:
- Parsing_Error: "5."
- Post-eligibility: "Near distance from the hospital (the patient can reach hospital within one hour )"
- Non-query-able: "Near distance from the hospital (the patient can reach hospital within one hour )"